有關自體免疫性肝炎（autoimmune hepatitis, AIH）之診斷與治療，根據International Autoimmune Hepatitis  Group的評分建議，以下何者錯誤？
A. 診斷自體免疫性肝炎之前需要先排除常見肝臟疾病，包括病毒性肝炎
B. 患者對免疫抑制療法的效果是診斷自體免疫性肝炎的評分項目之一
C. antinuclear antibody（ANA）是最重要常見的免疫學指標
D. 遺傳背景方面，AIH的發生與HLA-A2和DR6有相關

正確答案：D. 遺傳背景方面，AIH的發生與HLA-A2和DR6有相關